Clinical trial inclusion criterion:
HCV genotyping 1a, 1b, or mixed 1a/ab. Any non-definitive results will exclude the subject from study participation.

Entity relations:
- Has_value("HCV genotyping", "1a, 1b, or mixed 1a/ab")